Clinical trial exclusion criterion:
Active uncontrolled infection requiring antibiotics.

Annotated entities:
- Condition: "infection"
- Qualifier: "Active uncontrolled"
- Drug: "antibiotics"